Clinical trial inclusion criterion:
there is no inoculation history of EV71 vaccine, and there is no history of EV71 infection

Annotated entities:
- Negation: "no"
- Procedure: "inoculation"
- Temporal: "history"
- Drug: "EV71 vaccine"
- Negation: "no"
- Temporal: "history"
- Condition: "EV71 infection"